當病患使用滲透性利尿劑（osmotic diuretic）後，下列敘述何者正確？
A. 因改變血液的滲透度抑制抗利尿激素分泌，而產生利尿
B. 因改變尿液的滲透度抑制醛酮素的作用，而產生利尿
C. 尿液的滲透度將因尿中溶質增加，而變的較血漿高許多
D. 尿液的滲透度將趨近於血漿

正確答案：D. 尿液的滲透度將趨近於血漿